Clinical trial exclusion criterion:
antipsychotics or other dopamine antagonists

Entity relations:
- OR("antipsychotics", "dopamine antagonists")